Clinical trial exclusion criterion:
5. Acute myocardial infarction, cardiac ischemia indicated by 6-minute walk test, hypertrophic cardiomyopathy, constrictive pericarditis, significant valve disease or congenital heart disease, severe pulmonary hypertension;

Entity relations:
- Has_qualifier("valve disease", "significant")
- Has_qualifier("severe pulmonary hypertension", "severe")
- Has_qualifier("congenital heart disease", "congenital")
- Subsumes("Acute myocardial infarction", "6-minute walk test")
- OR("6-minute walk test", "hypertrophic cardiomyopathy", "constrictive pericarditis", "valve disease", "congenital heart disease", "severe pulmonary hypertension")
- OR("Acute myocardial infarction", "cardiac ischemia")